With periodontium with periodontal parameters different from those established in the inclusion criteria.

The above is a clinical trial exclusion criterion. Annotated with entity spans:
[Non-representable: With periodontium with periodontal parameters different from those established in the inclusion criteria.]